history of hypertension

The above is a clinical trial exclusion criterion. Annotated with entity spans:
[Temporal: history] of [Condition: hypertension]